某醫院急診處，突然來了 20 位從火車站受到不明氣體外洩傷害的傷患。大多數傷患皆有呼吸困難、涕泗橫流及瞳孔縮小的現象。以下各種處置，何者最不恰當？
A. 應於急診外建立沖洗除污區
B. 醫護人員應至少有 C 級防護裝備
C. 應準備充足之解毒劑（如：atropine、PAM）
D. 除污應使用高壓，單一的強力水注沖洗病患

正確答案：D. 除污應使用高壓，單一的強力水注沖洗病患